Clinical trial inclusion criterion:
Treatment naïve or treatment experienced (Peg-RBV or triple therapy).

Annotated entities:
- Condition: "Treatment naïve"
- Condition: "treatment experienced"
- Procedure: "Peg-RBV"
- Procedure: "triple therapy"